Combined P-glycoprotein and moderate CYP 3A4 inhibitor

The above is a clinical trial exclusion criterion. Annotated with entity spans:
Combined [Drug: P-glycoprotein] and [Qualifier: moderate] [Drug: CYP 3A4 inhibitor]